¿Se pueden realizar valoraciones potenciométricas a intensidad constante utilizando dos electrodos indicadores de la misma naturaleza?
1. No, solo se pueden hacer valoraciones potenciométricas a i = 0.
2. Sí.
3. No, solo se pueden llevar a cabo si utilizamos un electrodo de referencia.
4. Sí, pero solo en el caso que los dos electrodos fueran de paladio.

Respuesta correcta: 2. Sí.